Clinical trial exclusion criterion:
Non-resident of Scotland

Annotated entities:
- Person: "Non-resident"
- Visit: "Scotland"